Clinical trial inclusion criterion:
Estimated glomerular filtration rate =20 mL/min and <60 mL/min

Annotated entities:
- Measurement: "Estimated glomerular filtration rate"
- Value: "=20 mL/min and <60 mL/min"